Clinically significant findings on exam or ultrasound, such as salpingitis, hydrosalpynx or evidence of ovarian cysts

The above is a clinical trial exclusion criterion. Annotated with entity spans:
[Qualifier: Clinically significant] [Observation: findings] on [Procedure: exam] or [Procedure: ultrasound], such as [Condition: salpingitis], [Condition: hydrosalpynx] or [Mood: evidence] of [Condition: ovarian cysts]